Clinical trial exclusion criterion:
Significant O2 desaturation (SpO2 < 85%) at rest or during exercise

Entity relations:
- Has_value("SpO2", "< 85%")
- Has_qualifier("O2 desaturation", "Significant")
- Subsumes("Significant", "SpO2")
- Has_qualifier("O2 desaturation", "at rest")
- OR("at rest", "during exercise")